社會支持對健康行為具正向影響，如果小青提供家裡的桌球室讓鄰居來打球運動，是提供下列那一種社會支持？
A. 工具性支持
B. 情感性支持
C. 資訊性支持
D. 評價性支持

正確答案：A. 工具性支持